Clinical trial inclusion criterion:
Adenocarcinoma of low or moderate differentiation

Entity relations:
- Has_qualifier("Adenocarcinoma", "low or moderate differentiation")